Clinical trial inclusion criterion:
Female patients must be postmenopausal or must have had a bilateral oophorectomy or must have been surgically sterilized or hysterectomized at least 6 months prior to screening.

Entity relations:
- OR("surgically sterilized", "hysterectomized")
- Has_temporal("surgically sterilized", "at least 6 months prior to screening")
- OR("bilateral oophorectomy", "surgically sterilized")
- OR("postmenopausal", "bilateral oophorectomy")
- AND("Female", "postmenopausal")